La fructosa-1,6-bisfosfatasa:
1. Se inhibe por citrato.
2. Se activa por el AMP.
3. Libera un fosfato como Pi.
4. Es una enzima mitocondrial.
5. Cataliza una reacción reversible.

Respuesta correcta: 3. Libera un fosfato como Pi.